Clinical trial inclusion criterion:
History of coronary revascularization, i.e., percutaneous coronary intervention (PCI) or coronary artery bypass graft (CABG), not including the elective PCI during the index hospitalization

Entity relations:
- Has_index("during the index hospitalization", "index hospitalization")
- Has_qualifier("PCI", "elective")
- Has_negation("PCI", "not")
- Subsumes("coronary artery bypass graft", "CABG")
- Subsumes("percutaneous coronary intervention", "PCI")
- Subsumes("coronary revascularization", "percutaneous coronary intervention")
- Has_temporal("coronary revascularization", "during the index hospitalization")
- OR("percutaneous coronary intervention", "coronary artery bypass graft")